Clinical trial exclusion criterion:
Contraindications for Lactobacillus Vaginal Suppositories(those without sexual history)

Entity relations:
- Has_negation("sexual history", "without")
- AND("Contraindications", "Lactobacillus Vaginal Suppositories")
- Subsumes("Contraindications", "sexual history")